Clinical trial inclusion criterion:
Treated with Ursodeoxycholic Acid in West China Hospital for at least 6 month and suboptimal response to Ursodeoxycholic Acid

Annotated entities:
- Drug: "Ursodeoxycholic Acid"
- Visit: "West China Hospital"
- Temporal: "for at least 6 month"
- Condition: "suboptimal response"
- Drug: "Ursodeoxycholic Acid"